Clinical trial exclusion criterion:
non-reassuring fetal status

Entity relations:
- Has_qualifier("fetal status", "non-reassuring")